Current use of Amiodarone (Cordarone)

The above is a clinical trial exclusion criterion. Annotated with entity spans:
[Temporal: Current] use of [Drug: Amiodarone] ([Drug: Cordarone])